Clinical trial exclusion criterion:
Use of any systemic estrogen, progestin, or DHEA in the eight weeks prior to randomization.

Annotated entities:
- Drug: "systemic estrogen"
- Drug: "systemic progestin"
- Drug: "DHEA"
- Temporal: "in the eight weeks prior to randomization"